¿De qué tipo es el diagrama de fases para el sistema Cu-Ni?:
1. Binario con solubilidad total en estado sólido.
2. Eutéctico con insolubilidad total en estado sólido.
3. Eutéctico con solubilidad parcial en estado sólido.
4. Eutectoide.

Respuesta correcta: 1. Binario con solubilidad total en estado sólido.